HbA1c = 9% if on triple therapy or = 10% on diet & exercise or monotherapy or dual therapy

The above is a clinical trial inclusion criterion. Annotated with entity spans:
[Measurement: HbA1c] [Value: = 9%] if on triple therapy or [Value: = 10%] on diet & exercise or monotherapy or dual therapy